Es una molécula coestimuladora que se expresa en las células presentadoras de antígeno:
1. CD25.
2. CD20.
3. CD42.
4. CD18.
5. CD80.

Respuesta correcta: 5. CD80.